List proteins interacting with Star-PAP

Phosphorylation regulates the Star-PAP-PIPKIα interaction and directs specificity toward mRNA targets.
Star-PAP directly associated with cleavage and polyadenylation specificity factor (CPSF) 160 and 73 subunits and also the targeted pre-mRNA.
we show that Larp7 interacts with a poly(A) polymerase Star-PAP to maintain Lin28 mRNA stability.